La oxidación de Baeyer-Villiger de la ciclohexanona genera:
1. Un alcohol.
2. Una cetona.
3. Una lactona.
4. Una piridina.

Respuesta correcta: 3. Una lactona.